Clinical trial exclusion criterion:
Has hepatitis C in which participants received therapy for HCV <4 weeks prior to receiving pembrolizumab

Annotated entities:
- Condition: "hepatitis C"
- Procedure: "therapy for HCV"
- Temporal: "<4 weeks prior"
- Drug: "pembrolizumab"
- Reference_point: "receiving pembrolizumab"